Clinical trial inclusion criterion:
HCV treatment-naïve, as defined as no prior exposure to any Interferon (IFN), RBV, or other FDA approved or experimental HCV-specific direct-acting antiviral agent

Annotated entities:
- Negation: "naïve"
- Procedure: "treatment"
- Condition: "HCV"
- Drug: "Interferon (IFN)"
- Drug: "RBV"
- Non-representable: "other FDA approved or experimental HCV-specific direct-acting antiviral agent"
- Negation: "no"
- Temporal: "prior"